Clinical trial inclusion criterion:
Subjects with controlled diabetes prior to entry must have a mean systolic/diastolic office blood pressure =128/78 mmHg (sitting, after 5 minutes of rest)

Annotated entities:
- Condition: "diabetes"
- Qualifier: "controlled"
- Temporal: "prior to entry"
- Reference_point: "entry"
- Condition: "mean diastolic blood pressure"
- Condition: "mean systolic blood pressure"
- Value: "78 mmHg"
- Value: "128 mmHg"
- Qualifier: "sitting"
- Temporal: "after 5 minutes of rest"
- Reference_point: "rest"